Clinical trial inclusion criteria:
Histologic or cytologic diagnosis of stage IIIB/IV NSCLC
ECOG PS: 0,1
Unidimensional or bi-dimensional measurable disease
Receive prior treatment including first-line platinum-based chemotherapy, standard second-line chemotherapy and 1 EGF/EGFR inhibitor
Evidence of disease progression
Life expectancy >12 weeks
Neutrophils > 1.5 109/l, Platelets > 100 109/l, Hemoglobin > 9g/dl, Total bilirubin < 1.5 UNL, AST (SGOT) and ALT (SGPT) < 2.5 UNL, Alkaline phosphatases < 5 UNL, Creatinine < 1 UNL

Annotated entities:
- Procedure: "Histologic"
- Procedure: "cytologic"
- Condition: "NSCLC"
- Qualifier: "stage IIIB/IV"
- Measurement: "ECOG PS"
- Value: "0,1"
- Undefined_semantics: "measurable disease"
- Qualifier: "measurable"
- Subjective_judgement: "measurable"
- Non-query-able: "Unidimensional or bi-dimensional measurable disease"
- Procedure: "treatment"
- Procedure: "platinum-based chemotherapy"
- Procedure: "second-line chemotherapy"
- Drug: "1 EGF/EGFR inhibitor"
- Qualifier: "standard"
- Condition: "disease progression"
- Observation: "Evidence"
- Subjective_judgement: "Evidence of disease progression"
- Undefined_semantics: "Evidence of disease progression"
- Observation: "Life expectancy"
- Value: ">12 weeks"
- Measurement: "Neutrophils"
- Value: "> 1.5 109/l"
- Measurement: "Platelets"
- Value: "> 100 109/l"
- Measurement: "Hemoglobin"
- Value: "> 9g/dl"
- Measurement: "Total bilirubin"
- Value: "< 1.5 UNL"
- Measurement: "ALT (SGPT)"
- Value: "< 2.5 UNL"
- Measurement: "AST (SGOT)"
- Measurement: "Alkaline phosphatases"
- Value: "< 5 UNL"
- Measurement: "Creatinine"
- Value: "< 1 UNL"